Clinical trial inclusion criterion:
Clinical suspicion of Morton neuroma confirmed in ultrasound scan

Annotated entities:
- Condition: "Morton neuroma"
- Procedure: "ultrasound scan"
- Mood: "Clinical suspicion"